Non-invasive tear film break-up time (NITBUT) <10 s in at least one eye

The above is a clinical trial inclusion criterion. Annotated with entity spans:
[Measurement: Non-invasive tear film break-up time (NITBUT)] [Value: <10 s] in [Multiplier: at least one] [Qualifier: eye]